Los dialquilcupratos de litio reaccionan con halogenuros de alquilo para producir, por formación de enlaces carbono-carbono entre el grupo alquilo del halogenuro y el grupo alquilo del dialquilcuprato:
1. Alcanos.
2. Alquenos.
3. Alquinos.
4. Aromáticos.
5. Piranos.

Respuesta correcta: 1. Alcanos.